Clinical trial inclusion criterion:
Completion of the screening process within 28 days prior to dosing

Entity relations:
- Has_index("within 28 days prior to dosing", "dosing")
- Has_temporal("screening process", "within 28 days prior to dosing")